Clinical trial exclusion criterion:
Estimated fetal weight greater than 4500 grams in diabetic and 5000 grams in non-diabetic mother

Annotated entities:
- Measurement: "Estimated fetal weight"
- Value: "greater than 4500 grams"
- Condition: "diabetic"
- Value: "5000 grams"
- Negation: "non-"
- Condition: "diabetic"